Clinical trial exclusion criterion:
major axial deviation (varus >5° , valgus > 5°),

Entity relations:
- Has_value("valgus", "> 5°")
- Has_value("varus", ">5°")
- Subsumes("major axial deviation", "varus")
- OR("varus", "valgus")